23 歲女性，已婚但未曾懷孕，來門診請你開立避孕藥。她過去沒有重大內科疾病，沒有偏頭痛，也不曾得過性病。身體診查發現她的血壓為 160/100 mmHg，身高是 162 公分，體重為 82 公斤。下一步處置，以下何者最適當？
A. 應更進一步詢問病史，並評估血壓問題後再決定是否給避孕藥
B. 告訴病人她太胖了，應開給減肥藥，請病人一個月後複診
C. 直接開給避孕藥，請病人定時服用即可
D. 告訴病人她太胖了，不適合使用避孕藥

正確答案：A. 應更進一步詢問病史，並評估血壓問題後再決定是否給避孕藥